Clinical trial exclusion criterion:
Participants with a blood pressure in the 95th percentile or greater for age, sex, and height on 2 separate readings recorded on 2 separate days. Those participants who had uncontrolled hypertension at Screening can be rescreened more than 1 month after initiation or adjustment of antihypertensive therapy 1 time.

Annotated entities:
- Measurement: "blood pressure"
- Value: "95th percentile or greater"
- Qualifier: "for age"
- Qualifier: "for sex"
- Qualifier: "for height"
- Multiplier: "2 separate readings"
- Qualifier: "2 separate days"
- Non-representable: "Those participants who had uncontrolled hypertension at Screening can be rescreened more than 1 month after initiation or adjustment of antihypertensive therapy 1 time."